Blood donation of more than 450ml in the previous three months.

The above is a clinical trial exclusion criterion. Annotated with entity spans:
[Procedure: Blood donation] [Qualifier: of more than 450ml] [Temporal: in the previous three months].